La neuraminidasa del virus de la gripe:
1. Se encuentra en el interior de la cápside y se libera tras penetrar en la célula.
2. Tiene como función facilitar la encapsulación del material genético.
3. Es una de las espículas de la envoltura.
4. No es antigénica.
5. Facilita la adsorción del virus a la célula.

Respuesta correcta: 3. Es una de las espículas de la envoltura.